Clinical trial exclusion criterion:
planning to move in next 12-24 months

Entity relations:
- Has_temporal("planning to move", "in next 12-24 months")